Are willing to make a smoking cessation attempt

The above is a clinical trial inclusion criterion. Annotated with entity spans:
[Post-eligibility: Are willing to make a smoking cessation attempt]